Clinical trial exclusion criterion:
sleep disordered breathing (diagnosed OSA, obesity hypoventilation syndrome)

Entity relations:
- Subsumes("sleep disordered breathing", "OSA")
- OR("OSA", "obesity hypoventilation syndrome")